Has clinically apparent ascites on physical examination

The above is a clinical trial exclusion criterion. Annotated with entity spans:
Has clinically apparent [Condition: ascites] on physical examination